下列導致兒童患門脈高壓（portal hypertension）的疾病，何者預後最差？
A. 肝外門靜脈栓塞（extrahepatic portal vein obstruction）
B. 新生兒曾插入臍靜脈管（catheterization of umbilical vein）
C. 硬化性膽管炎（sclerosing cholangitis）
D. 脾臟動靜脈瘻管（splenic arteriovenous fistula）

正確答案：C. 硬化性膽管炎（sclerosing cholangitis）